Clinical trial exclusion criterion:
20. Significant/chronic renal insufficiency.

Entity relations:
- Has_qualifier("chronic renal insufficiency", "Significant")